18years to 65years

The above is a clinical trial inclusion criterion. Annotated with entity spans:
[Value: 18years to 65years]